Clinical trial exclusion criteria:
mRS=2;
History of stroke within 3 months;
History of intracranial hemorrhage;
Suspected subarachnoid hemorrhage;
Intracranial tumour, vascular malformation or arterial aneurysm;
Major surgery within 1 month;
Systolic pressure =180 mmHg or diastolic pressure =110 mmHg;
Platelet count < 105/mm3;
Heparin therapy or oral anticoagulation therapy within 48 hours;
Abnormal APTT;
Thrombin or Xa factor inhibitor;
Severe disease with a life expectancy of less than 3 months;
Blood glucose < 50 mg/dL (2.7mmol/L);
Patients who have received any other investigational drug or device within 3 months;
Pregnancy;
Researchers consider patients inappropriate to participate in the registry.

Annotated entities:
- Measurement: "mRS"
- Value: "=2"
- Condition: "stroke"
- Value: "within 3 months"
- Condition: "intracranial hemorrhage"
- Condition: "subarachnoid hemorrhage"
- Condition: "Intracranial tumour"
- Condition: "vascular malformation"
- Condition: "arterial aneurysm"
- Procedure: "Major surgery"
- Value: "within 1 month"
- Measurement: "Systolic pressure"
- Value: "=180 mmHg"
- Measurement: "diastolic pressure"
- Value: "=110 mmHg"
- Measurement: "Platelet count"
- Value: "< 105/mm3"
- Drug: "Heparin"
- Procedure: "therapy"
- Procedure: "oral anticoagulation therapy"
- Temporal: "within 48 hours"
- Value: "Abnormal"
- Measurement: "APTT"
- Drug: "Thrombin"
- Drug: "Xa factor inhibitor"
- Observation: "life expectancy"
- Value: "less than 3 months"
- Condition: "disease"
- Qualifier: "Severe"
- Measurement: "Blood glucose"
- Value: "< 50 mg/dL"
- Value: "2.7mmol/L"
- Competing_trial: "Patients who have received any other investigational drug or device within 3 months;"
- Condition: "Pregnancy"
- Non-query-able: "Researchers consider patients inappropriate to participate in the registry."